Clinical trial inclusion criterion:
Informed consent

Annotated entities:
- Non-query-able: "Informed consent"